Clinical trial exclusion criterion:
Poorly controlled hypertension as assessed by the investigator

Entity relations:
- Has_qualifier("hypertension", "Poorly controlled")